下列那種藥物給予孕婦使用，可能引起胎兒動脈導管（ductus arteriosus）之早期閉鎖？
A. chloramphenicol
B. cimetidine
C. indomethacin
D. ritodrine

正確答案：C. indomethacin